Clinical trial exclusion criterion:
Diagnosed diabetes;

Annotated entities:
- Condition: "diabetes"